真性多血症（polycythemia vera）的病人最常出現何種基因的突變？
A. ABL
B. JAK2
C. BCL1
D. MYC

正確答案：B. JAK2